Women of childbearing potential (WOCP) who are not using at least one method of contraception.

The above is a clinical trial exclusion criterion. Annotated with entity spans:
[Pregnancy_considerations: Women of childbearing potential (WOCP) who are not using at least one method of contraception].